Clinical trial exclusion criteria:
Those subjects with previous use of vitamin D.
Known subjects with renal, liver, calcium metabolism disorders, malabsorption disorders, known neoplasms.
Subjects with serum calcium levels equal to or greater than 10.2 mg / dl.

Annotated entities:
- Temporal: "previous use"
- Drug: "vitamin D"
- Condition: "disorders renal"
- Condition: "disorders liver"
- Condition: "calcium metabolism disorders"
- Condition: "malabsorption disorders"
- Condition: "neoplasms"
- Measurement: "serum calcium levels"
- Value: "equal to or greater than 10.2 mg / dl"